Clinical trial exclusion criterion:
Patients with liver cirrhosis, Hepatocellular Carcinoma or other malignancies.

Entity relations:
- OR("liver cirrhosis", "Hepatocellular Carcinoma", "malignancies")